Pregnant, contemplating getting pregnant, or breastfeeding

The above is a clinical trial exclusion criterion. Annotated with entity spans:
[Pregnancy_considerations: Pregnant, contemplating getting pregnant, or breastfeeding]